Informed consent for inclusion into the database is obtained

The above is a clinical trial inclusion criterion. Annotated with entity spans:
[Informed_consent: Informed consent for inclusion into the database is obtained]